Clinical trial inclusion criterion:
HBsAg and HBeAg positive for more than 6 months, HBV DNA detectable with ALT level abnormal lasted for three months and at least time190 IU/L or liver puncture biopsy demonstrated apparent inflammation, never treated before enrolled.

Annotated entities:
- Condition: "HBeAg positive"
- Condition: "HBsAg positive"
- Temporal: "for more than 6 months"
- Condition: "HBV DNA detectable"
- Measurement: "ALT level"
- Value: "abnormal"
- Temporal: "lasted for three months"
- Temporal: "at least time"
- Value: "190 IU/L"
- Procedure: "liver puncture biopsy"
- Condition: "inflammation"
- Negation: "never"
- Procedure: "treated"
- Temporal: "before enrolled"
- Reference_point: "enrolled"
- Procedure: "enrolled"